Clinical trial exclusion criterion:
Metastatic disease (M1)

Annotated entities:
- Condition: "Metastatic disease (M1)"